Clinical trial inclusion criterion:
Antiretroviral naive

Annotated entities:
- Condition: "naive"
- Drug: "Antiretroviral"